Clinical trial exclusion criterion:
Patients with keloids on the intended biopsy site

Annotated entities:
- Condition: "keloids"
- Qualifier: "on the intended biopsy site"